Clinical trial exclusion criterion:
History of prior stroke

Annotated entities:
- Condition: "stroke"
- Temporal: "prior"